Clinical trial inclusion criterion:
Adult patients ≥ 19 years of age who are able to freely provide informed consent

Entity relations:
- Has_value("age", "≥ 19 years")